Clinical trial exclusion criterion:
History of ischemic stroke or pulmonary thrombosis

Entity relations:
- Has_temporal("ischemic stroke", "History")
- OR("ischemic stroke", "pulmonary thrombosis")